Clinical trial inclusion criterion:
Greater than or 18 years of age

Entity relations:
- Has_value("age", "Greater than or 18 years")